Clinical trial inclusion criterion:
with at least one occlusal or occlusal proximal caries lesion in primary molars

Entity relations:
- Has_qualifier("caries lesion", "occlusal")
- Has_qualifier("caries lesion", "primary molars")
- Has_multiplier("caries lesion", "at least one")
- OR("occlusal", "occlusal proximal")